Isolated target on initial imagery (invasive hepatocellular carcinoma excluded)

The above is a clinical trial inclusion criterion. Annotated with entity spans:
[Context_Error: Isolated target on initial imagery (invasive hepatocellular carcinoma excluded)]